Clinical trial exclusion criterion:
Presence of acid reflux or heartburn symptoms of more than twice a month

Entity relations:
- Has_temporal("acid reflux", "more than twice a month")
- OR("acid reflux", "heartburn symptoms")